Streptococus agalactiae, Escherichia coli y Listeria monocytogenes son los microorganismos que se encuentran con más frecuencia implicados en la meningitis en:
1. Neonatos.
2. Inmunocomprometidos.
3. Mujeres.
4. Enfermos hospitalizados.
5. Ancianos.

Respuesta correcta: 1. Neonatos.